Clinical trial exclusion criterion:
The patient had a coronary stent for less than 12 months

Entity relations:
- Has_temporal("coronary stent", "less than 12 months")